La magnitud de la concentración plasmática en estado estacionario que se alcanza cuando se administra un fármaco monocompartimental en perfusión continua está condicionada por:
1. El tiempo que se mantiene la perfusión.
2. La relación entre la velocidad de entrada de fármaco al organismo (mg/h) y la constante de velocidad de eliminación.
3. La relación entre la velocidad de entrada al organismo (mg/h) y la semivida de eliminación del fármaco.
4. La relación entre la velocidad de entrada al organismo (mg/h) y el aclaramiento plasmático.
5. La administración de una dosis de choque por vía intravenosa rápida al inicio del tratamiento.

Respuesta correcta: 4. La relación entre la velocidad de entrada al organismo (mg/h) y el aclaramiento plasmático.